Patients weighing more than 30 kg that would exceed maximum dexamethasone dose

The above is a clinical trial exclusion criterion. Annotated with entity spans:
Patients [Measurement: weighing] [Value: more than 30 kg] [Non-representable: that would exceed maximum dexamethasone dose]